List protein gel staining methods visualizing the entire protein set.

Several staining protocols for the visualization of proteins separated by SDS-PAGE have been described in literature: 
fluorescence
Sypro Ruby
Colloidal Coomassie Blue
Coomassie Blue
Silver staining
Coomassie Brilliant Blue